Clinical trial exclusion criterion:
(1) Menopause (non-therapy-induced amenorrhea of more than 12 months) Female

Annotated entities:
- Condition: "Menopause"
- Qualifier: "non-therapy-induced"
- Condition: "amenorrhea"
- Multiplier: "more than 12 months"
- Person: "Female"